chemotherapy for a malignancy within the previous 5 years

The above is a clinical trial exclusion criterion. Annotated with entity spans:
[Procedure: chemotherapy] for a [Condition: malignancy] [Temporal: within the previous 5 years]